ASA I-III patients scheduled for elective one or two level minimally invasive lumbar fusions

The above is a clinical trial inclusion criterion. Annotated with entity spans:
[Measurement: ASA] [Value: I-III] patients [Mood: scheduled] for [Qualifier: elective] [Qualifier: one] or [Qualifier: two level] [Procedure: minimally invasive lumbar fusions]